Known sensitivity to E. coli derived products

The above is a clinical trial exclusion criterion. Annotated with entity spans:
Known [Condition: sensitivity] to [Qualifier: E. coli derived] [Drug: products]